Al conjunto de todas las moléculas de ARN de una célula transcritas a partir de un genoma se denominan:
1. Proteoma.
2. Metagenoma.
3. Transcriptoma.
4. Mebaoloma.
5. Metiloma.

Respuesta correcta: 3. Transcriptoma.